腎臟移植時發生超急性排斥（hyperacute rejection），其原因是抗體攻擊腎臟的何種細胞或組織？
A. 血管內皮細胞（vascular endothelium）
B. 腎膈細胞（mesangial cell）
C. 腎小管上皮細胞（renal tubular epithelial cell）
D. 鮑氏囊（Bowman's capsule）

正確答案：A. 血管內皮細胞（vascular endothelium）